最好發在兒童的腦瘤為下列何者？
A. 髓母細胞瘤（medulloblastoma）
B. 室管膜瘤（ependymoma）
C. 星狀細胞瘤（astrocytoma）
D. 腦膜瘤（meningioma）

正確答案：A. 髓母細胞瘤（medulloblastoma）